Clinical trial inclusion criterion:
Patients of ASA status I - III

Entity relations:
- Has_value("ASA status", "I - III")